針對患有乳癌的病人，做病史及理學檢查的評估，以決定是否為高危險病患時，下列何項不必列入考慮？
A. 停經在55歲之後
B. 未產婦（nulliparity）
C. 曾有甲狀腺病史
D. 初經小於12歲

正確答案：C. 曾有甲狀腺病史